Which gene is responsible for proper speech development?

Transcription factor forkhead box protein P2 (FOXP2) plays an essential role in the development of language and speech.